Which disease is Dasatinib used to treat?

Dasatinib is a small molecule covalently binding and inhibiting BCR-ABL receptor. It is used for treatment of chronic myelogenous leukemia (CML) by targeting the integrins avb3 and avb5 over-expressed on B cells.